Clinical trial exclusion criterion:
Evidence of a clinically significant neurological disease that might affect cognition (e.g., delirium, dementia, epilepsy, head trauma, and multiple sclerosis)

Annotated entities:
- Mood: "Evidence"
- Qualifier: "clinically significant"
- Condition: "neurological disease"
- Qualifier: "might affect cognition"
- Condition: "delirium"
- Condition: "dementia"
- Condition: "epilepsy"
- Condition: "head trauma"
- Condition: "multiple sclerosis"